Clinical trial exclusion criterion:
Ongoing dementia treatment or anti-depressive disorder medication

Entity relations:
- AND("treatment", "dementia")
- Has_temporal("treatment", "Ongoing")
- OR("treatment", "anti-depressive disorder medication")